Clinical trial exclusion criterion:
Cardiac disease (congenital or acquired)

Annotated entities:
- Condition: "Cardiac disease"
- Qualifier: "congenital"
- Qualifier: "acquired"